Clinical trial exclusion criterion:
Additional medication: Use of the following medications within the following time intervals prior to Visit 1 or during the study (unless otherwise specified):

Annotated entities:
- Parsing_Error: "Additional medication: Use of the following medications within the following time intervals prior to Visit 1 or during the study (unless otherwise specified):"